Clinical trial exclusion criterion:
Type 1 diabetes, Secondary diabetes, gestational diabetes

Annotated entities:
- Condition: "Type 1 diabetes"
- Condition: "Secondary diabetes"
- Condition: "gestational diabetes"